一位 45 歲男性，1 個月前因為右腳大拇趾關節處紅腫疼痛，在檢驗所抽血檢查，發現白血球數目為 28,500/mm3。理學檢查發現右腳大拇趾處有輕微疼痛，但據病人自述紅腫已較 1 個月前減輕，其他無特殊異常。重新驗血檢查，數值如下：血紅素 15.0 g/dL，血比容 46.5%，白血球 35,450/mm3，分類 blast 0.25%，promyelocyte 4.25%，myelocyte 8.5%，metamyelocyte 5.75%，band 9.5%，segmented neutrophil 50.75%，eosinophil 2.75%，basophil 4.5%，monocyte 1.5%，lymphocyte 12.25%，血小板 319,000/mm3，白血球鹼性磷酸（LAP）活性 28，LDH 1,148 U/L，AST 50 U/L，ALT 23 U/L。下列何項檢查對診斷此男士白血球過多症的原因最有幫助？
A. Uric acid
B. Hepatitis B and C serology
C. X-ray of the right big toe
D. Bone marrow chromosome analysis

正確答案：D. Bone marrow chromosome analysis